Clinical trial inclusion criterion:
Age between 20 and 80 years

Entity relations:
- Has_value("Age", "between 20 and 80 years")